Clinical trial inclusion criterion:
Pulse oximetry of 90% or greater on room air

Entity relations:
- Has_value("Pulse oximetry", "90% or greater")
- Has_qualifier("Pulse oximetry", "on room air")